For melanoma patients, If patients have a history of malignancy other than melanoma, and other skin cancers in the past five years, their inclusion is up to the discretion of the physician.

The above is a clinical trial inclusion criterion. Annotated with entity spans:
For [Condition: melanoma] patients, If patients have a [Temporal: history] of [Condition: malignancy] [Negation: other than] [Condition: melanoma], [Grammar_Error: and] other [Condition: skin cancers] [Temporal: in the past five years], their inclusion is [Subjective_judgement: up to the discretion of the physician].